Tissue from tumor must be available. This may be paraffin embedded tissue from previous biopsy/resection or if it is not available, a repeat biopsy must be performed. The requirement for biopsy may be waived if alpha-fetoprotein is greater than 500 ng/mL and in the investigators opinion not explained by a concurrent hepatic inflammatory process.

The above is a clinical trial inclusion criterion. Annotated with entity spans:
Tissue from tumor must be available. This may be paraffin embedded tissue from previous biopsy/resection or if it is not available, a repeat biopsy must be performed. The requirement for [Procedure: biopsy] may be waived if [Measurement: alpha-fetoprotein] is [Value: greater than 500 ng/mL] and in the investigators opinion not explained by a concurrent hepatic inflammatory process.